Congenital or acquired immunodeficiency or ongoing therapy that cause immunosuppression

The above is a clinical trial exclusion criterion. Annotated with entity spans:
Congenital or [Condition: acquired immunodeficiency] or [Temporal: ongoing] [Procedure: therapy that cause immunosuppression]